Oswestry Questionnaire score of at least 40/100 at baseline.

The above is a clinical trial inclusion criterion. Annotated with entity spans:
[Measurement: Oswestry Questionnaire score] of [Value: at least 40/100] [Temporal: at baseline].